Clinical trial inclusion criterion:
No prior use of somatostatin analogues.

Entity relations:
- Has_temporal("somatostatin analogues", "prior")
- Has_negation("somatostatin analogues", "No")